Clinical trial exclusion criterion:
Known chronic liver disease, renal disease requiring dialysis or bleeding disorder

Entity relations:
- Has_mood("dialysis", "requiring")
- AND("renal disease", "dialysis")
- OR("chronic liver disease", "bleeding disorder", "renal disease")